Clinical trial exclusion criterion:
Unable to speak Spanish or English

Annotated entities:
- Non-query-able: "Unable to speak Spanish or English"